unwilling/unable to sign informed consent document

The above is a clinical trial exclusion criterion. Annotated with entity spans:
[Post-eligibility: unwilling/unable to sign informed consent document]